Nitroprusside 及 nitroglycerin 之抗高血壓或治療心絞痛作用乃經由下列何種酵素而導致平滑肌鬆弛？
A. Membrane-bound guanylate cyclase
B. Cytosolic guanylate cyclase
C. Phosphodiesterase
D. Protein kinase A

正確答案：B. Cytosolic guanylate cyclase